Tobacco use: Subjects with a current or prior history of >=10 pack-years of cigarette smoking at screening (Visit 1). Previous smokers are defined as those who have stopped smoking for at least 6 months prior to Visit 1.

The above is a clinical trial inclusion criterion. Annotated with entity spans:
Tobacco use: Subjects with a [Temporal: current] or [Temporal: prior] [Temporal: history] of [Multiplier: >=10 pack-years] of [Observation: cigarette smoking] [Temporal: at screening] (Visit 1). [Condition: Previous smokers] are defined as those who have [Observation: stopped smoking] [Temporal: for at least 6 months prior to Visit 1].